催化轉胺反應（transamination）的酵素，需要利用下列何種維生素做為胺基暫時的攜帶者？
A. flavin adenine dinucleotide（vitamin B2）
B. pyridoxal phosphate（vitamin B6）
C. tetrahydrofolate（H4 folate）
D. thiamin pyrophosphate（vitamin B1）

正確答案：B. pyridoxal phosphate（vitamin B6）